足月兒出生時，母親有發燒症狀且羊膜已在出生前兩天破裂，嬰兒於出生後8小時開始明顯的呼吸窘迫，血壓下降，胸部X光呈現雙側全面的浸潤，並有少許肋膜腔積水，最可能的診斷為下列何者？
A. 大腸桿菌（Escherichia coli）感染
B. 綠膿桿菌（Pseudomonas spp.）感染
C. 肺炎鏈球菌（Streptococcus pneumoniae）感染
D. B群鏈球菌（group B Streptococcus）感染

正確答案：D. B群鏈球菌（group B Streptococcus）感染